在下列何種情況下，acetyl-CoA進入citric acid cycle會減少？
A. [AMP]/[ATP]高
B. [ATP]/[ADP]高
C. [NAD+]/[NADH]高
D. [oxaloacetate]高

正確答案：B. [ATP]/[ADP]高